Any other indication for dual antiplatelet therapy, i.e. recent stent implantation

The above is a clinical trial exclusion criterion. Annotated with entity spans:
Any other [Condition: indication] for [Condition: dual antiplatelet therapy], i.e. [Temporal: recent] [Procedure: stent implantation]